Clinical trial inclusion criterion:
Liver imaging within 6 months of Baseline/Day 1 to exclude hepatocellular carcinoma HCC) is required

Entity relations:
- Has_temporal("Liver imaging", "within 6 months of Baseline/Day 1")
- Has_negation("hepatocellular carcinoma HCC)", "exclude")
- AND("Liver imaging", "hepatocellular carcinoma HCC)")